Unilateral leg pain secondary to lateral stenosis, disc protrusion or herniated disc.

The above is a clinical trial inclusion criterion. Annotated with entity spans:
[Condition: Unilateral leg pain] secondary to [Condition: lateral stenosis], [Condition: disc protrusion] or [Condition: herniated disc].